黃疸是	床上常	的症	。有一個20 歲	輕男性，無任何肝臟病史，門診主訴	健康檢查中，發現血清 Bilirubin 2.9/0.5 ㎎/dL（Total/Direct, reference value:＜1.0/＜0.3 mg/dL），其他肝功能檢查都正常，血清肝炎標誌都是陰性反應；	學檢查無	常，沒有搔癢症狀。下	何種診斷最有可能？
A. 肝內膽汁滯	（Cholestasis）
B. Dubin-Johnson Syndrome
C. Gilbert's Syndrome
D. Rotor Syndrome

正確答案：C. Gilbert's Syndrome